Clinical trial inclusion criterion:
No other surgical contraindications.

Entity relations:
- Has_negation("other surgical contraindications", "No")